La Ley General de Sanidad (Ley 14/1986, de 25 de abril) favoreció la reforma psiquiátrica en España porque:
1. Dio carta de naturaleza al modelo manicomial.
2. Definió el modelo biomédico de asistencia al enfermo psiquiátrico.
3. Institucionalizó la estructura comunitaria conformada por equipos interdisciplinarios.
4. Reguló los factores y elementos de la calidad asistencial.
5. Adoptó un modelo paternalista de protección al enfermo mental.

Respuesta correcta: 3. Institucionalizó la estructura comunitaria conformada por equipos interdisciplinarios.